Contraindications to magnetic resonance imaging (MRI).

The above is a clinical trial exclusion criterion. Annotated with entity spans:
[Condition: Contraindications] to [Procedure: magnetic resonance imaging (MRI)].